Treated with rituximab in the last 12 months

The above is a clinical trial exclusion criterion. Annotated with entity spans:
Treated with [Drug: rituximab] [Temporal: in the last 12 months]